La fiebre Q está causada por:
1. Coxiella burnetii.
2. Toxoplasma gondii.
3. Corynebacterium diphtheriae.
4. Brucella melitensis.

Respuesta correcta: 1. Coxiella burnetii.